Clinical trial inclusion criteria:
An average defecation frequency (DF) of <3 per week based on a 3-week defecation diary (patient-reported)
Meet at least one other criterion of the Rome-IV criteria for idiopathic constipation based on the 3-week defecation diary (1)
Refractory to conservative treatment
Age: 14-80 years
Straining during =25% of defecations
Lumpy or hard stools in =25% of defecations
Sensation of incomplete evacuation for =25% of defecations
Sensation of anorectal obstruction/blockage for =25% of defecations
Manual manoeuvres to facilitate =25% of defecations

Annotated entities:
- Measurement: "average defecation frequency"
- Measurement: "DF"
- Value: "<3 per week"
- Procedure: "3-week defecation diary"
- Qualifier: "patient-reported"
- Multiplier: "at least one"
- Measurement: "Rome-IV criteria for idiopathic constipation"
- Condition: "idiopathic constipation"
- Procedure: "3-week defecation diary"
- Qualifier: "other"
- Condition: "criterion"
- Procedure: "conservative treatment"
- Qualifier: "Refractory"
- Person: "Age"
- Value: "14-80 years"
- Condition: "Straining"
- Multiplier: "=25%"
- Condition: "defecations"
- Observation: "hard stools"
- Observation: "Lumpy stools"
- Condition: "defecations"
- Multiplier: "=25%"
- Condition: "Sensation of incomplete evacuation"
- Multiplier: "=25%"
- Condition: "defecations"
- Condition: "defecations"
- Multiplier: "=25%"
- Condition: "Sensation of anorectal obstruction"
- Condition: "Sensation of anorectal blockage"
- Condition: "defecations"
- Multiplier: "=25%"
- Procedure: "Manual manoeuvres"